50 歲女性，在接受乳房例行性攝影時發現右乳側下方有微小鈣化（micro-calcification）的表徵，臨床理學檢查無法觸摸到腫塊位置，請問病人最可能的診斷是：
A. phyllodes tumor
B. medullary carcinoma
C. ductal carcinoma
D. lobular carcinoma

正確答案：C. ductal carcinoma